Clinical trial exclusion criterion:
allergy to Doxycycline or Methylprednisolone,

Entity relations:
- AND("allergy", "Doxycycline")
- OR("Doxycycline", "Methylprednisolone")